Infrequently uses condoms during sex with 1 or more partners of unknown HIV status who are known to be at substantial risk of HIV infection (IDU or bisexual male partner)

The above is a clinical trial inclusion criterion. Annotated with entity spans:
[Observation: Infrequently uses condoms during sex] with [Multiplier: 1 or more] [Person: partners of unknown HIV status] who are known to be [Observation: at substantial risk of HIV infection] ([Person: IDU] or [Person: bisexual male partner])